下列何者為治療成人股骨幹骨折（Femoral shaft fracture）最常使用的方法？
A. 骨髓內釘（Intramedullary nail）
B. 動態性壓迫性鋼板（Dynamic compression plate）
C. 骨骼牽引（Skeletal traction）
D. 外固定（External fixator）

正確答案：A. 骨髓內釘（Intramedullary nail）